Clinical trial inclusion criterion:
Subjects must have read and signed the Informed Consent Form prior to study-specific-procedures not part of standard of care

Annotated entities:
- Informed_consent: "Subjects must have read and signed the Informed Consent Form prior to study-specific-procedures not part of standard of care"